History of noncompliance to medical regimens or unwillingness to comply with the study protocol

The above is a clinical trial exclusion criterion. Annotated with entity spans:
[Temporal: History of] [Observation: noncompliance to medical regimens] or [Mood: unwillingness to] [Informed_consent: comply with the study protocol]